Clinical trial inclusion criteria:
3-17 years
weight </= 100kg
scheduled for urologic or orthopedic procedure necessitating intrathecal morphine
ability to use verbal or pictorial pain assessment tools and techniques
informed consent and (if applicable) assent

Annotated entities:
- Person: "3-17 years"
- Value: "3-17 years"
- Measurement: "weight"
- Value: "</= 100kg"
- Procedure: "orthopedic procedure"
- Procedure: "urologic procedure"
- Drug: "morphine"
- Qualifier: "intrathecal"
- Condition: "ability"
- Procedure: "pictorial pain assessment tools and techniques"
- Procedure: "verbal pain assessment tools and techniques"
- Informed_consent: "informed consent and (if applicable) assent"